Clinical trial exclusion criterion:
Concomitant antiplatelet or anticoagulant use

Annotated entities:
- Drug: "antiplatelet"
- Drug: "anticoagulant"
- Temporal: "Concomitant"